Clinical trial inclusion criterion:
Patients less than 16 years old with newly diagnosed PML-RARa positive acute promyelocytic leukemia.

Annotated entities:
- Value: "less than 16 years"
- Person: "old"
- Measurement: "PML-RARa"
- Value: "positive"
- Condition: "acute promyelocytic leukemia"